Self-identified African American

The above is a clinical trial inclusion criterion. Annotated with entity spans:
Self-identified [Person: African American]